Severe gastrointestinal disease, including gastroparesis. As judged by the Investigator.

The above is a clinical trial exclusion criterion. Annotated with entity spans:
[Qualifier: Severe] [Condition: gastrointestinal disease], including [Condition: gastroparesis]. As judged by the Investigator.